Clinical trial exclusion criterion:
Stroke or transient ischemic attack

Annotated entities:
- Condition: "transient ischemic attack"
- Condition: "Stroke"